Clinical trial exclusion criterion:
Milller Class 4 recession defects

Entity relations:
- Has_value("Milller", "Class 4")
- AND("recession defects", "Milller")